Las dineínas son proteínas:
1. Motoras.
2. Responsables del dinamismo de la matriz extracelular.
3. Exclusivas de los cilios.
4. Exclusivas de los flagelos.
5. Tipo actina.

Respuesta correcta: 1. Motoras.